原本健康之年輕人因感染腦膜炎球菌（Neisseria meningitidis）引起的腦膜炎，48 小時內快速死亡。 下列敘述何者錯誤？
A. 腦膜炎球菌為革蘭氏陽性雙球菌，且有夾膜（polysaccharide capsule）
B. 腦膜炎球菌是藉由飛沫傳播，因此與病人有密切接觸且未適當防護之醫療人員，要接受預防性抗菌藥物之治療
C. 有些人呈現鼻咽帶菌狀態但卻沒有發生侵襲性感染
D. 人體的補體系統（complement system）是重要的宿主防衛系統

正確答案：A. 腦膜炎球菌為革蘭氏陽性雙球菌，且有夾膜（polysaccharide capsule）